Clinical trial exclusion criterion:
chronic pancreatitis

Annotated entities:
- Condition: "chronic pancreatitis"
- Multiplier: "chronic"
- Condition: "pancreatitis"